Clinical trial exclusion criterion:
a history of use of alpha 2 receptor agonists or antagonists.

Annotated entities:
- Temporal: "history"
- Drug: "alpha 2 receptor agonists"
- Drug: "alpha 2 receptor antagonists"